有關醫師施行手術取得病患告知後同意之過程中，最常忽略而引起糾紛的是：
A. 未簽署手術同意書
B. 未獲病人同意
C. 未說明醫療費用
D. 未提供病人足夠諮詢及病情說明

正確答案：D. 未提供病人足夠諮詢及病情說明